Clinical trial exclusion criterion:
chronic disease-Immunocompromised

Annotated entities:
- Condition: "Immunocompromised"